Clinical trial exclusion criterion:
Diagnosis of primary progressive MS

Annotated entities:
- Condition: "progressive MS"
- Qualifier: "primary"